Biliary strictures caused by malignancies other than pancreatic cancer, distal CBD cholangiocarcinoma and other periampullary cancers

The above is a clinical trial exclusion criterion. Annotated with entity spans:
[Condition: Biliary strictures] caused by [Condition: malignancies] [Negation: other than] [Condition: pancreatic cancer], [Condition: distal CBD cholangiocarcinoma] and [Condition: other periampullary cancers]